Heavy alcoholics

The above is a clinical trial exclusion criterion. Annotated with entity spans:
[Qualifier: Heavy] [Condition: alcoholics]